Clinical trial inclusion criterion:
Age 18 to 75 years old (male or female).

Entity relations:
- Has_value("Age", "18 to 75 years old")
- AND("Age", "male")
- OR("male", "female")